What is the active ingredient of Eligard?

The active ingredient of Eligard is leuprorelin acetate.